Clinical trial exclusion criterion:
existing neurological deficit in the area to be blocked;

Entity relations:
- Has_qualifier("neurological deficit", "area to be blocked")
- Has_temporal("neurological deficit", "existing")